Clinical trial inclusion criterion:
Persistence of hCG is defined as at least 2 serial hCG values (over 2-14 days), showing < 15% rise per day, or < 50% fall between the first and last value.

Entity relations:
- Has_value("hCG", "< 15% rise per day")
- Has_temporal("hCG", "over 2-14 days")
- OR("< 15% rise per day", "< 50% fall between the first and last value.")